一個 8 個月大的健康男嬰，突發間歇性哭鬧，嘔吐，並解出黏液血便，則最可能的診斷為：
A. 急性腸胃炎（acute gastroenteritis）
B. 腸道扭轉不全（malrotation）
C. 腸套疊（intussusception）
D. 腹股溝疝氣（inguinal hernia）

正確答案：C. 腸套疊（intussusception）